3. Expected poor compliance with the study protocol.

The above is a clinical trial exclusion criterion. Annotated with entity spans:
[Parsing_Error: 3.] [Non-query-able: Expected poor compliance with the study protocol.]